Clinical trial exclusion criterion:
Subject participated in an investigational drug study within 30 days prior to Visit 1

Entity relations:
- Has_index("within 30 days prior to Visit 1", "Visit 1")
- Has_temporal("participated in an investigational drug study", "within 30 days prior to Visit 1")